currently receiving a stable antiretroviral regimen comprising of:

The above is a clinical trial inclusion criterion. Annotated with entity spans:
currently receiving a stable [Procedure: antiretroviral regimen] comprising of: